50歲男性，體重60公斤。因燒燙傷合併急性呼吸窘迫症候群接受呼吸器治療，三天後其動脈血液氣體分析為：pH = 7.50；PaCO2 = 22 mmHg；PaO2 = 78 mmHg。其呼吸器設定吸入氧氣濃度（FiO2）= 0.5，呼吸次數 = 14次/min，潮氣容積（tidal volume）= 660 mL，吐氣末正壓值（PEEP）= 10 cmH2O，吸氣最大流量 （peak inspiratory flow）= 60 L/min。則應調整那個參數值最為妥當？
A. 增加吸入氧氣濃度（FiO2）
B. 增加吐氣末正壓值（PEEP）
C. 減少潮氣容積（tidal volume）
D. 增加吸氣最大流量（peak inspiratory flow）

正確答案：C. 減少潮氣容積（tidal volume）